use of drugs that affect respiratory center drive

The above is a clinical trial exclusion criterion. Annotated with entity spans:
[Non-query-able: use of drugs that affect respiratory center drive]